下列何種母親的狀況（maternal condition），最可能與胎兒羊水過多（hydramnios）有相關性？
A. 李斯特菌病（Listeriosis）
B. 鐮刀型血球貧血（sickle-cell anemia）
C. 糖尿病（diabetes）
D. 紅斑性狼瘡（systemic lupus erythematosus）

正確答案：C. 糖尿病（diabetes）